Clinical trial inclusion criterion:
Teeth used are able to be isolated with rubber dam

Annotated entities:
- Non-representable: "Teeth used are able to be isolated with rubber dam"